EDSS score 0.0 to 5.0 (inclusive) at Screening

The above is a clinical trial inclusion criterion. Annotated with entity spans:
[Measurement: EDSS score] [Value: 0.0 to 5.0] (inclusive) at Screening